History of a liver biopsy showing cirrhosis (e.g. Metavir score = 4 or Ishak score > 5)

The above is a clinical trial inclusion criterion. Annotated with entity spans:
History of a [Procedure: liver biopsy] showing [Condition: cirrhosis] (e.g. [Measurement: Metavir score] [Value: = 4] or [Measurement: Ishak score] [Value: > 5])